Clinical trial inclusion criteria:
Patients aged =50 years with DM2 and symptomatic PAD diagnosed clinically (according to Fontaine criteria, stage IIa or IIb and III) and by measuring the <U+0391><U+0392><U+0399>.

Annotated entities:
- Person: "aged"
- Value: "=50 years"
- Condition: "DM2"
- Condition: "PAD"
- Qualifier: "symptomatic"
- Measurement: "Fontaine criteria"
- Value: "stage IIa or IIb and III"
- Non-representable: "by measuring the <U+0391><U+0392><U+0399>"